Clinical trial exclusion criterion:
Already taking Metformin or any other drug intended to treat diabetes

Entity relations:
- Has_qualifier("drug", "diabetes")
- OR("Metformin", "drug")